Clinical trial exclusion criterion:
Hepatic disease

Annotated entities:
- Condition: "Hepatic disease"